Acute or chronic disease, as diabetes, heart disease, systemic arterial hypertension;

The above is a clinical trial exclusion criterion. Annotated with entity spans:
[Condition: Acute] or [Condition: chronic disease], as [Condition: diabetes], [Condition: heart disease], [Condition: systemic arterial hypertension];